Heparin therapy or oral anticoagulation therapy within 48 hours;

The above is a clinical trial exclusion criterion. Annotated with entity spans:
[Drug: Heparin] [Procedure: therapy] or [Procedure: oral anticoagulation therapy] [Temporal: within 48 hours];